4. Diagnosis of Omenn's syndrome or MHC class I deficiency

The above is a clinical trial exclusion criterion. Annotated with entity spans:
[Parsing_Error: 4.] Diagnosis of [Condition: Omenn's syndrome] or [Condition: MHC class I deficiency]